下列有關冠狀動脈介入性（intervention）治療引起的再狹窄（restenosis）之敘述，何者錯誤？
A. 治療部位的血管壁外層收縮（adventitial constriction）使血管腔（lumen）窄縮
B. 治療部位的血管壁平滑肌增生，使內膜肥厚（neointimal hyperplasia）
C. 較長的病變以及糖尿病人較容易有再狹窄產生
D. 支架治療可避免血管壁外層收縮，也可減少血管壁平滑肌增生導致再狹窄之機轉

正確答案：D. 支架治療可避免血管壁外層收縮，也可減少血管壁平滑肌增生導致再狹窄之機轉